Clinical trial exclusion criterion:
Expected survival less than 1 year;

Annotated entities:
- Observation: "Expected survival"
- Value: "less than 1 year"